No cases of fragile X syndrome in the family or blepharophimosis syndrome

The above is a clinical trial inclusion criterion. Annotated with entity spans:
[Negation: No] cases of [Condition: fragile X syndrome] [Observation: in the family] or [Condition: blepharophimosis syndrome]